一位 6 週大的男嬰，本來長得白白胖胖，但最近幾天開始有明顯吐奶的情形。根據其母親敘述，小朋友似乎很想吸奶，但吸了不久就吐光，吐了以後又很想再吸。嘔吐物是白白的。你認為下列何項檢查最優先？
A. 仔細觸診上腹部
B. 腹部 X 光
C. 腹部超音波
D. 上消化道攝影

正確答案：A. 仔細觸診上腹部